Clinical trial inclusion criterion:
Histopathologic confirmed squamous cell carcinoma of head and neck ,including oral cavity, oropharynx, larynx, or hypopharynx.

Annotated entities:
- Procedure: "Histopathologic"
- Condition: "squamous cell carcinoma"
- Qualifier: "Histopathologic confirmed"
- Qualifier: "head and neck"
- Qualifier: "oral cavity"
- Qualifier: "oropharynx"
- Qualifier: "larynx"
- Qualifier: "hypopharynx"